¿Qué aspecto en común tienen los tratamientos conductuales para el trastorno depresivo mayor?
1. La utilización de técnicas de exposición a las situaciones estresantes.
2. El objetivo principal de modificar las creencias y suposiciones desadaptativas que hacen a una persona vulnerable a la depresión.
3. Que son terapias no estructuradas y sin un número limitado de sesiones.
4. El objetivo principal de aumentar el refuerzo positivo que recibe la persona deprimida.
5. El objetivo principal de relacionar la depresión con situaciones interpersonales problemáticas.

Respuesta correcta: 4. El objetivo principal de aumentar el refuerzo positivo que recibe la persona deprimida.